Clinical trial exclusion criteria:
1. A medical condition, other than PBC, that in the investigator's opinion would preclude full participation in the study or confound its results (e.g., cancer on active treatment)
2. AST or ALT > 3 × ULN
3. Total bilirubin > 2 × ULN
4. Auto-immune hepatitis
5. Primary sclerosing cholangitis
6. Known history of alpha-1-Antitrypsin deficiency
7. Known history of chronic viral hepatitis
8. Creatine kinase above ULN
9. Serum creatinine above ULN
10. For females, pregnancy or breast-feeding
11. Use of colchicine, methotrexate, azathioprine, or systemic steroids in the two months preceding screening
12. Current use of fibrates, including fenofibrates, or simvastatin
13. Use of an experimental treatment for PBC
14. Use of experimental or unapproved immunosuppressant
15. Any other condition(s) that would compromise the safety of the subject or compromise the quality of the clinical study, as judged by the Investigator

Annotated entities:
- Parsing_Error: "1."
- Condition: "medical condition"
- Condition: "PBC"
- Negation: "other than"
- Subjective_judgement: "in the investigator's opinion"
- Non-query-able: "A medical condition, other than PBC, that in the investigator's opinion would preclude full participation in the study or confound its results (e.g., cancer on active treatment)"
- Post-eligibility: "A medical condition, other than PBC, that in the investigator's opinion would preclude full participation in the study or confound its results (e.g., cancer on active treatment)"
- Parsing_Error: "2."
- Measurement: "AST"
- Measurement: "ALT"
- Value: "> 3 × ULN"
- Parsing_Error: "3."
- Measurement: "Total bilirubin"
- Value: "> 2 × ULN"
- Parsing_Error: "4."
- Condition: "Auto-immune hepatitis"
- Parsing_Error: "5."
- Condition: "Primary sclerosing cholangitis"
- Parsing_Error: "6."
- Condition: "alpha-1-Antitrypsin deficiency"
- Temporal: "history"
- Parsing_Error: "7."
- Condition: "viral hepatitis"
- Temporal: "chronic"
- Temporal: "history"
- Parsing_Error: "8."
- Measurement: "Creatine kinase"
- Value: "above ULN"
- Parsing_Error: "9."
- Measurement: "Serum creatinine"
- Value: "above ULN"
- Parsing_Error: "10."
- Person: "females"
- Condition: "pregnancy"
- Condition: "breast-feeding"
- Parsing_Error: "11."
- Drug: "colchicine"
- Drug: "methotrexate"
- Drug: "azathioprine"
- Drug: "systemic steroids"
- Temporal: "in the two months preceding screening"
- Reference_point: "screening"
- Parsing_Error: "12."
- Drug: "fibrates"
- Temporal: "Current"
- Drug: "fenofibrates"
- Drug: "simvastatin"
- Parsing_Error: "13."
- Procedure: "experimental treatment for PBC"
- Undefined_semantics: "experimental treatment for PBC"
- Context_Error: "experimental treatment for PBC"
- Parsing_Error: "14."
- Drug: "immunosuppressant"
- Qualifier: "unapproved"
- Qualifier: "experimental"
- Undefined_semantics: "experimental or unapproved"
- Context_Error: "experimental or unapproved"
- Parsing_Error: "15."
- Non-query-able: "Any other condition(s) that would compromise the safety of the subject or compromise the quality of the clinical study, as judged by the Investigator"
- Context_Error: "Any other condition(s) that would compromise the safety of the subject or compromise the quality of the clinical study, as judged by the Investigator"
- Post-eligibility: "Any other condition(s) that would compromise the safety of the subject or compromise the quality of the clinical study, as judged by the Investigator"
- Subjective_judgement: "Any other condition(s) that would compromise the safety of the subject or compromise the quality of the clinical study, as judged by the Investigator"